患有前列腺肥大排尿不易的高血壓病人，宜使用下列何種降血壓藥物來治療？
A. Clonidine
B. Yohimbine
C. Terazosin
D. Ritodrine

正確答案：C. Terazosin